關於消化性潰瘍手術之方法，下列敘述何者正確？
A. truncal vagotomy 一般不需要同時施行 pyloroplasty 手術
B. highly selective vagotomy 要同時切除支配 gastric antrum 的迷走神經
C. 所謂 Billroth I procedure 指的是將切掉 antrum 的胃與近端空腸吻合
D. 對於太大的胃潰瘍，可以考慮做 truncal vagotomy 及 antrectomy

正確答案：D. 對於太大的胃潰瘍，可以考慮做 truncal vagotomy 及 antrectomy